¿Cuál de las siguientes es una característica del tratamiento psicofarmacológico del TDAH?
1. Para disminuir la inquietud motora se suelen emplear fármacos ansiolíticos.
2. Entre sus posibles efectos secundarios se encuentran el empeoramiento de la conducta a última hora del día (efecto rebote) y la intensificación de tics ya existentes.
3. El efecto del metilfenidato se mantiene a medio plazo una vez interrumpido el tratamiento.
4. Puede mejorar la atención y disminuir la hiperactividad pero no es efectivo para manejar las conductas impulsivas.
5. Cuando es efectivo en mejorar la atención y controlar la hiperactividad hace innecesaria la intervención psicológica.

Respuesta correcta: 2. Entre sus posibles efectos secundarios se encuentran el empeoramiento de la conducta a última hora del día (efecto rebote) y la intensificación de tics ya existentes.